Clinical trial exclusion criterion:
Women of child-bearing potential

Annotated entities:
- Person: "Women"
- Condition: "child-bearing potential"